Clinical trial exclusion criterion:
History or other evidence of a medical condition associated with chronic liver disease other than HBV (e.g., hemochromatosis, autoimmune hepatitis, metabolic liver diseases including Wilson's and alpha1-antitrypsin deficiency, alcoholic liver disease, toxin exposures, thalassemia).

Annotated entities:
- Condition: "medical condition"
- Condition: "chronic liver disease"
- Negation: "other than"
- Condition: "HBV"
- Condition: "hemochromatosis"
- Condition: "autoimmune hepatitis"
- Condition: "metabolic liver diseases"
- Condition: "Wilson's"
- Condition: "alpha1-antitrypsin deficiency"
- Condition: "alcoholic liver disease"
- Condition: "toxin exposures"
- Condition: "thalassemia"